Clinical trial inclusion criterion:
18years to 65years

Entity relations:
- Has_value("years", "18years to 65years")